從遭到愛滋病毒感染，到以檢測試劑可偵測到感染的這約一個月的期間，稱為：
A. 空窗期
B. 潛伏期
C. 恢復期
D. 惡化期

正確答案：A. 空窗期